停經後婦女不正常子宮出血，最常見的原因是：
A. 荷爾蒙失調或補充荷爾蒙引起的
B. 子宮內膜癌
C. 子宮頸癌
D. 子宮息肉

正確答案：A. 荷爾蒙失調或補充荷爾蒙引起的